Clinical trial exclusion criteria:
PRA > 50%
DSA > 1500 MFI
Retransplantation
Patients who are planning to receive mycophenolate instead of everolimus
Patients who have planning for follow-up in another center

Annotated entities:
- Measurement: "PRA"
- Value: "> 50%"
- Measurement: "DSA"
- Value: "> 1500 MFI"
- Condition: "Retransplantation"
- Mood: "planning to"
- Drug: "mycophenolate"
- Negation: "instead of"
- Drug: "everolimus"
- Mood: "planning for"
- Procedure: "follow-up"
- Visit: "another center"